Clinical trial exclusion criterion:
Pregnancy or breast-feeding

Entity relations:
- OR("Pregnancy", "breast-feeding")